Clinical trial exclusion criterion:
10. Known immunodeficiency or HIV, Hepatitis B or Hepatitis C positivity.

Entity relations:
- OR("immunodeficiency", "Hepatitis B", "HIV", "Hepatitis C")